Clinical trial inclusion criterion:
B. Non-castrate metastatic: Patients must present with radiographic evidence of metastatic disease at the time of diagnosis or after treatment for localized disease. These patients must show newly detected disease or progressing disease in bone or in soft tissue. Biochemical progression is defined as: minimum no. of determinations: 3 Interval: >2 weeks Minimal Baseline PSA value (ng/ml): 2 Minimal % increase in range of values: 50%

Entity relations:
- Has_context("radiographic", "radiographic evidence")
- AND("radiographic", "metastatic disease")
- Has_index("at the time of diagnosis", "the time of diagnosis")
- Has_temporal("metastatic disease", "at the time of diagnosis")
- Has_qualifier("metastatic disease", "Non-castrate")
- Has_value("Minimal % increase in range of values", "50%")
- Has_value("Minimal Baseline PSA value", "(ng/ml): 2")
- Has_value("minimum no. of determinations", "3")
- Has_value("Interval", ">2 weeks")
- AND("Biochemical progression", "Minimal % increase in range of values")
- Has_temporal("disease in bone", "newly detected")
- Has_context("progressing disease in soft tissue", "Biochemical progression")
- Has_context("progressing disease in bone", "Biochemical progression")
- Has_index("after treatment for localized disease", "treatment for localized disease")
- AND("metastatic disease", "treatment")
- AND("metastatic disease", "localized disease")
- Has_qualifier("metastatic disease", "metastatic")
- AND("Biochemical progression", "Minimal Baseline PSA value")
- AND("Biochemical progression", "minimum no. of determinations")
- AND("Biochemical progression", "Interval")
- OR("at the time of diagnosis", "after treatment for localized disease")
- OR("disease in bone", "progressing disease in soft tissue", "disease in soft tissue", "progressing disease in bone")